小兒骨髓炎（osteomyelitis）最常經由下列何種途徑感染？
A. 外傷直接感染
B. 血液傳播
C. 鄰近組織傳播
D. 呼吸傳播

正確答案：B. 血液傳播